Clinical trial exclusion criterion:
Allergy to liraglutide or any of the active ingredients in liraglutide or other GLP-1 analogue

Entity relations:
- AND("Allergy", "liraglutide")
- OR("liraglutide", "GLP-1 analogue")